Patients must be >= 19 years of age

The above is a clinical trial inclusion criterion. Annotated with entity spans:
Patients must be [Value: >= 19 years] of [Person: age]